有關骨折癒合（Fracture healing）的描述，何者錯誤？
A. 炎性期（Inflammation），蝕骨細胞（Osteoclasts）及纖維芽細胞（fibroblasts）明顯增生
B. 修補期（Repair），骨折二星期內 Soft Callus 開始形成，爾後為 Hard Callus 取代
C. 修飾期（Remodeling）於修補期的中期就開始，可於臨床骨折癒合後持續多年
D. 骨折癒合與病人營養狀況及骨折處固定穩定與否，有相當大的關係

正確答案：A. 炎性期（Inflammation），蝕骨細胞（Osteoclasts）及纖維芽細胞（fibroblasts）明顯增生